有關直腸癌的經肛門局部切除治療，下列敘述何者錯誤？
A. 須小於 4 公分的 T1 和 T2 癌瘤才可使用
B. 癌瘤須在離肛門口 6 公分以內的範圍才能採用此療法
C. T1 和 T2 的癌瘤皆不需再接受進一步的治療
D. 癌瘤必須是分化良好或中度分化者

正確答案：C. T1 和 T2 的癌瘤皆不需再接受進一步的治療